Clinical trial exclusion criterion:
Evidence of decompensated liver disease (Childs B-C), hepato-cellular carcinoma, pre-existing severe depression or other psychiatric disease, significant cardiac disease, significant renal disease, seizure disorders or severe retinopathy.

Entity relations:
- Has_qualifier("liver disease", "decompensated")
- Has_value("Childs", "B-C")
- Subsumes("liver disease", "Childs")
- Has_qualifier("cardiac disease", "significant")
- Has_qualifier("renal disease", "significant")
- Has_qualifier("psychiatric disease", "other")
- Has_qualifier("depression", "severe")
- Has_temporal("depression", "pre-existing")
- OR("depression", "psychiatric disease")
- OR("liver disease", "depression", "retinopathy", "severe", "seizure disorders", "renal disease", "cardiac disease", "hepato-cellular carcinoma")